Clinical trial exclusion criterion:
Musculoskeletal disorders preventing the subject to perform physical training

Entity relations:
- Has_qualifier("Musculoskeletal disorders", "preventing the subject to perform physical training")